Muchos adolescentes piensan que son especiales, que tienen una vida excepcional o que lo que les sucede es único y no ha sido experimentado por nadie antes ¿Cómo se denomina este sesgo egocéntrico particularmente frecuente en la adolescencia?:
1. Sesgo de la unicidad.
2. Audiencia imaginaria.
3. Fábula personal.
4. Sesgo de autoengrandecimiento.

Respuesta correcta: 3. Fábula personal.